What is Q-nexus?

Q-nexus is a comprehensive and efficient analysis pipeline designed for ChIP-nexus.